Person is walking on level ground in a step over step manner.

The above is a clinical trial inclusion criterion. Annotated with entity spans:
[Non-query-able: Person is walking on level ground in a step over step manner].